have actively suicidal thought(Suicidal ideation score of MADRS is 6)

The above is a clinical trial exclusion criterion. Annotated with entity spans:
have [Condition: actively suicidal thought]([Measurement: Suicidal ideation score of MADRS] is [Value: 6])